Clinical trial exclusion criterion:
Coagulopathy or bleeding tendency caused by organ dysfunction, such as cirrhosis, bone marrow suppression etc.

Entity relations:
- Subsumes("organ dysfunction", "cirrhosis")
- AND("Coagulopathy", "organ dysfunction")
- OR("cirrhosis", "bone marrow suppression")
- OR("Coagulopathy", "bleeding tendency")